¿Cuál de los siguientes patógenos es el causante de la enfermedad por arañazo de gato?
1. Bartonella henselae.
2. Mycobacterium tuberculosis.
3. Mycobacterium avium complex.
4. Toxoplasma gondii.
5. Virus de Epstein Barr.

Respuesta correcta: 1. Bartonella henselae.